Clinical trial inclusion criterion:
Pulse oximetry of 90% or greater on room air

Annotated entities:
- Measurement: "Pulse oximetry"
- Value: "90% or greater"
- Qualifier: "on room air"